Clinical trial inclusion criterion:
Bishop-Score = 6

Entity relations:
- Has_value("Bishop-Score", "= 6")